Clinical trial inclusion criterion:
Patients presenting for CMR evaluation of chest pain but without evidence of obstructive coronary artery disease either by coronary angiography or stress testing.

Entity relations:
- AND("obstructive coronary artery disease", "coronary angiography")
- Has_negation("obstructive coronary artery disease", "without")
- AND("chest pain", "obstructive coronary artery disease")
- OR("coronary angiography", "stress testing")